Clinical trial inclusion criteria:
History of falls or dizziness at exit from bed in the morning (at least two incidents in the past year)
At least 20/200 corrected visual acuity
Stable health
Normal hearing

Annotated entities:
- Condition: "falls"
- Condition: "dizziness"
- Temporal: "at exit from bed in the morning"
- Multiplier: "at least two"
- Condition: "incidents"
- Temporal: "in the past year"
- Value: "At least 20/200"
- Measurement: "corrected visual acuity"
- Condition: "Stable health"
- Condition: "Normal hearing"